Clinical trial exclusion criterion:
Smokers

Annotated entities:
- Condition: "Smokers"